Clinical trial exclusion criterion:
History of deep vein thrombosis, ischemic heart disease or stroke

Entity relations:
- OR("deep vein thrombosis", "stroke", "ischemic heart disease")